Clinical trial exclusion criterion:
7. Severe left ventricular hypertrophy or severe valvular disease

Entity relations:
- Has_qualifier("left ventricular hypertrophy", "Severe")
- OR("left ventricular hypertrophy", "severe", "valvular disease")